關於痔瘡（hemorrhoid）的敘述，何者錯誤？
A. 痔瘡是肛門黏膜下的構造其中包含動靜脈及平滑肌等組織
B. 在維持肛門括約方面扮演重要角色
C. 痔瘡切除術可用在保守治療無效的病患
D. 所有的痔瘡都需要手術治療

正確答案：D. 所有的痔瘡都需要手術治療